In what percentage of skeletal muscle fibers is dystrophin expression restored after PPMO- mediated exon skipping?

PPMO-mediated exon skipping restored the dystrophin expression in nearly 100% skeletal muscle fibers in all age groups.